Clinical trial exclusion criterion:
2. Are pregnant or lactating

Annotated entities:
- Condition: "pregnant"
- Condition: "lactating"